El programa de Deblinger y Heflin (1996) para el tratamiento de menores que han sufrido abuso sexual se fundamenta en diferentes módulos, entre los que se encuentra:
1. El entrenamiento en habilidades de afrontamiento.
2. Evitación activa de situaciones aversivas.
3. Inundación.
4. Evitación de conductas estereotipadas.
5. Sobrecorrección.

Respuesta correcta: 1. El entrenamiento en habilidades de afrontamiento.